Clinical trial inclusion criteria:
Adult men and women> 18 years old
Presence of sustained ventricular tachycardia with HR> 120 bpm
Systolic blood pressure> 90 mmHg
No signs of poor peripheral perfusion
Absence of dyspnea
Absence of severe angina
Signed consent form

Annotated entities:
- Person: "Adult"
- Person: "men"
- Person: "women"
- Value: "> 18 years old"
- Person: "old"
- Qualifier: "sustained"
- Condition: "ventricular tachycardia"
- Measurement: "HR"
- Value: "> 120 bpm"
- Measurement: "Systolic blood pressure"
- Value: "> 90 mmHg"
- Negation: "No"
- Mood: "signs of"
- Condition: "poor peripheral perfusion"
- Condition: "dyspnea"
- Negation: "Absence of"
- Negation: "Absence of"
- Condition: "angina"
- Qualifier: "severe"
- Informed_consent: "Signed consent form"